Hormone replacement therapy

The above is a clinical trial exclusion criterion. Annotated with entity spans:
[Procedure: Hormone replacement therapy]